Clinical trial exclusion criteria:
History of allergic reaction to compounds of similar chemical or biologic composition to hCG
receiving medication that could interfere with the study protocol objectives (hormonal contraceptives, androgens, prednisone, thyroid hormones, insulin)
previous treatment with follicle stimulating hormone for assisted reproduction
uncontrolled intercurrent illness
Heart disease
Severe cognitive decline
Psychiatric desease
HIV positive
Hepatitis B or C infection

Annotated entities:
- Temporal: "History"
- Condition: "allergic reaction"
- Drug: "compounds of similar chemical or biologic composition to hCG"
- Drug: "hCG"
- Drug: "medication"
- Qualifier: "could interfere with the study protocol objectives"
- Drug: "hormonal contraceptives"
- Drug: "androgens"
- Drug: "prednisone"
- Drug: "thyroid hormones"
- Drug: "insulin"
- Temporal: "receiving"
- Temporal: "previous"
- Procedure: "treatment"
- Drug: "follicle stimulating hormone"
- Procedure: "assisted reproduction"
- Qualifier: "uncontrolled"
- Condition: "intercurrent illness"
- Condition: "Heart disease"
- Qualifier: "Severe"
- Condition: "cognitive decline"
- Condition: "Psychiatric desease"
- Condition: "HIV positive"
- Condition: "Hepatitis B infection"
- Condition: "Hepatitis C infection"